Clinical trial inclusion criterion:
Type 2 diabetes

Annotated entities:
- Condition: "Type 2 diabetes"